List Genes associated with adolescent idiopathic scoliosis

No genetic associations have yet been found to adolescent idiopathic scoliosis.